Clinical trial inclusion criterion:
>5 pack-year history of smoking

Entity relations:
- Has_value("pack-year", ">5")
- AND("smoking", "pack-year")